Clinical trial inclusion criterion:
Weight >5kg

Annotated entities:
- Person: "Weight"
- Value: ">5kg"